Clinical trial exclusion criteria:
Psychotic depression by DSM-IV, i.e., presence of delusions with a SCID-R score higher than 2;
High suicide risk, i.e. intent or plan to attempt suicide in near future;
Presence of any Axis I psychiatric disorder (other than unipolar major depression) or substance abuse;
History of psychiatric disorders other than unipolar major depression or generalized anxiety disorder (bipolar disorder, hypomania, and dysthymia are exclusion criteria);
Dementia: Diagnosis of dementia by DSM-IV;
Mild Cognitive Impairment (MCI);
Acute or severe medical illness, i.e., delirium, metastatic cancer, decompensated cardiac, liver or kidney failure, major surgery, stroke or myocardial infarction during the three months prior to entry; or use of drugs known to cause depression, e.g., reserpine, alpha-methyl-dopa, steroids, sympathomimetics withdrawal;
Neurological brain disease and/or history of electroconvulsive therapy;
History of any use of citalopram or escitalopram during the current episode or need for drugs that may interact with these agents, i.e. drug metabolized by the 2D6 P450 isoenzyme system;
Current involvement in psychotherapy;
Contraindications to MRI scanning including cardiac pacemaker, metallic objects and metallic implants contraindicating MRI, cardiac stent, claustrophobia;
Inability to speak English;
Corrected visual acuity < 20/70; Color blindness.

Annotated entities:
- Condition: "Psychotic depression"
- Qualifier: "DSM-IV"
- Condition: "delusions"
- Measurement: "SCID-R score"
- Value: "higher than 2"
- Observation: "suicide risk"
- Qualifier: "High"
- Mood: "intent"
- Mood: "plan to"
- Observation: "attempt suicide"
- Temporal: "in near future"
- Condition: "psychiatric disorder"
- Qualifier: "Axis I"
- Negation: "other than"
- Condition: "unipolar major depression"
- Condition: "substance abuse"
- Condition: "psychiatric disorders"
- Negation: "other than"
- Condition: "unipolar major depression"
- Condition: "generalized anxiety disorder"
- Condition: "bipolar disorder"
- Condition: "hypomania"
- Condition: "dysthymia"
- Condition: "Dementia"
- Qualifier: "DSM-IV"
- Condition: "Mild Cognitive Impairment"
- Condition: "MCI"
- Condition: "medical illness"
- Qualifier: "Acute"
- Qualifier: "severe"
- Condition: "delirium"
- Condition: "metastatic cancer"
- Qualifier: "decompensated"
- Condition: "cardiac failure"
- Condition: "liver failure"
- Condition: "kidney failure"
- Procedure: "major surgery"
- Condition: "stroke"
- Condition: "myocardial infarction"
- Temporal: "three months prior to entry"
- Reference_point: "entry"
- Drug: "drugs"
- Condition: "depression"
- Drug: "reserpine"
- Drug: "alpha-methyl-dopa"
- Drug: "steroids"
- Condition: "sympathomimetics withdrawal"
- Condition: "brain disease"
- Qualifier: "Neurological"
- Procedure: "electroconvulsive therapy"
- Drug: "citalopram"
- Drug: "escitalopram"
- Qualifier: "current"
- Condition: "episode"
- Drug: "drugs"
- Drug: "agents"
- Non-query-able: "need for drugs that may interact with these agents, i.e. drug metabolized by the 2D6 P450 isoenzyme system"
- Procedure: "psychotherapy"
- Condition: "Contraindications"
- Procedure: "MRI"
- Device: "cardiac pacemaker"
- Device: "metallic objects"
- Device: "metallic implants"
- Device: "cardiac stent"
- Condition: "claustrophobia"
- Post-eligibility: "Inability to speak English"
- Measurement: "visual acuity"
- Qualifier: "Corrected"
- Value: "< 20/70;"
- Condition: "Color blindness"